Clinical trial inclusion criterion:
Patients with symptomatic persistent atrial fibrillation of less than 1-year duration.

Annotated entities:
- Condition: "atrial fibrillation"
- Qualifier: "persistent"
- Qualifier: "symptomatic"
- Temporal: "less than 1-year"